Treated with greater than 10 mg of prednisone (or equivalent) daily in the last 6 months

The above is a clinical trial exclusion criterion. Annotated with entity spans:
Treated with [Multiplier: greater than 10 mg] of [Drug: prednisone] (or equivalent) [Multiplier: daily] [Temporal: in the last 6 months]